Have osteoporosis

The above is a clinical trial exclusion criterion. Annotated with entity spans:
Have [Condition: osteoporosis]